Clinical trial exclusion criterion:
Current tobacco use

Entity relations:
- Has_temporal("tobacco use", "Current")